Clinical trial inclusion criterion:
Subject with a total serum testosterone level = 300 ng/dL, with or without supplementation

Entity relations:
- Has_value("total serum testosterone level", "= 300 ng/dL")